Which drugs affect insulin resistance in obesity?

Enistein treatment could help reduce insulin resistance
ACE inhibitor drugs may improve insulin resistance